Histopathologic confirmed squamous cell carcinoma of head and neck ,including oral cavity, oropharynx, larynx, or hypopharynx.

The above is a clinical trial inclusion criterion. Annotated with entity spans:
[Qualifier: Histopathologic confirmed] [Condition: squamous cell carcinoma] of [Qualifier: head and neck] ,including [Qualifier: oral cavity], [Qualifier: oropharynx], [Qualifier: larynx], or [Qualifier: hypopharynx].